Differential blood count < lower limit of normal (LLN) at Screening

The above is a clinical trial exclusion criterion. Annotated with entity spans:
[Measurement: Differential blood count] [Value: < lower limit of normal (LLN)] [Temporal: at Screening]